Clinical trial exclusion criterion:
Patients with a value of alpha-fetoprotein >100 ng/mL are excluded, unless stability (less than 10% increase) has been documented over at least the previous 3 months.

Annotated entities:
- Measurement: "alpha-fetoprotein"
- Value: ">100 ng/mL"
- Temporal: "at least the previous 3 months"
- Reference_point: "the previous 3 months"
- Condition: "stability"
- Value: "less than 10%"
- Measurement: "increase"
- Negation: "unless"